一位 5 歲女童持續發燒四天，有雙側結膜炎、咳嗽、流鼻水、咽部扁桃腺發炎，下列那一種病原的可能性最高？
A. group A streptococcus
B. Epstein-Barr virus
C. enterovirus
D. adenovirus

正確答案：D. adenovirus